40 歲女性，左腎上腺皮質發現一腫瘤。檢驗數據顯示血清 ACTH 值並無異常，但血清腎素（renin）及血鉀離子明顯下降。病理檢查發現腫瘤呈鮮黃色，顯微鏡下腫瘤細胞含多量脂質。腫瘤附近的腎上腺皮質和對側腎上腺皮質並無萎縮現象。下列腎上腺腫瘤中，何者最符合此病人的臨床及病理特徵？
A. metastatic renal cell carcinoma
B. aldosterone-producing adenoma
C. cortisol-producing adenoma
D. pheochromocytoma

正確答案：B. aldosterone-producing adenoma